Estimated GFR (eGFR) < 60 mL/min/1.73 m2 and blood glucose > 135 mg/dl; Past or present history of acute renal failure, renal dialysis, diabetes mellitus.

The above is a clinical trial exclusion criterion. Annotated with entity spans:
[Measurement: Estimated GFR] ([Measurement: eGFR]) [Value: < 60 mL/min/1.73 m2] and [Measurement: blood glucose] [Value: > 135 mg/dl]; Past or present history of [Condition: acute renal failure], [Procedure: renal dialysis], [Condition: diabetes mellitus].